Clinical trial exclusion criterion:
Patients with any peripheral neuropathy or unresolved diarrhea greater than Grade 1

Entity relations:
- AND("unresolved diarrhea", "Grade")
- Has_value("Grade", "greater than 1")
- OR("peripheral neuropathy", "unresolved diarrhea")